下列何者不屬於卵巢癌的危險因子？
A. 從未生育
B. 長期使用避孕藥物
C. 一等親有卵巢癌病史
D. 本身有乳癌病史

正確答案：B. 長期使用避孕藥物